Congestive heart failure

The above is a clinical trial exclusion criterion. Annotated with entity spans:
[Condition: Congestive heart failure]